History of gastrectomy, short bowel syndrome;

The above is a clinical trial exclusion criterion. Annotated with entity spans:
[Temporal: History] of [Procedure: gastrectomy], [Condition: short bowel syndrome];